根據美國精神醫學會之「精神疾患診斷及統計手冊第四版」，下列何者不屬於 B 群組之人格疾患 （Cluster B personality disorders）？
A. 妄想性人格疾患
B. 反社會人格疾患
C. 邊緣性人格疾患
D. 自戀性人格疾患

正確答案：A. 妄想性人格疾患